List 3 diseases for which saRNAs have been evaluated as a potential treatment.

saRNAs have been tested for the treatment of breast, bladder, liver cancer and more.